下列寄生蟲之配對中，何者在患者新鮮糞便中均含有對人類之感染型（infective forms）？
A. 環胞子蟲（Cyclospora cayetanensis）及雙核阿米巴（Dientamoeba fragilis）
B. 人肉胞子蟲（Sarcocystis hominis）及梨形鞭毛蟲（Giardia lamblia）
C. 隱胞子蟲（Cryptosporidium parvum）及嗜碘阿米巴（Iodamoeba bütschlii）
D. 等胞子蟲（Isospora belli）及大腸纖毛蟲（Balantidium coli）

正確答案：C. 隱胞子蟲（Cryptosporidium parvum）及嗜碘阿米巴（Iodamoeba bütschlii）